hormonal contraception

The above is a clinical trial exclusion criterion. Annotated with entity spans:
[Procedure: hormonal contraception]